Clinical trial exclusion criterion:
Newly started hormone therapy within the last 6 months

Annotated entities:
- Multiplier: "Newly started"
- Procedure: "hormone therapy"
- Temporal: "within the last 6 months"